Clinical trial exclusion criterion:
ischemic heart disease;

Annotated entities:
- Condition: "ischemic heart disease"